Clinical trial exclusion criteria:
Regular cigarette smoker
Alcohol abuse
Drug abuse

Annotated entities:
- Observation: "Regular cigarette smoker"
- Observation: "Alcohol abuse"
- Observation: "Drug abuse"